What is the Lupus Severity Index (LSI)?

The Lupus Severity Index (LSI) is a simple, reliable, and valid measure of disease severity in patients with systemic lupus erythematosus. The index can be used to identify patients at risk for acute exacerbations of Lupus nephritis. Based on the score, patients were classified into five different groups, one with the most severe, the other with the worst prognosis, and the others with the best prognosis.